Clinical trial exclusion criterion:
Patient unable or unwilling to have high compression (30mmHg minimum)

Annotated entities:
- Post-eligibility: "Patient unable or unwilling to have high compression (30mmHg minimum)"